Clinical trial inclusion criterion:
Left ventricular ejection fraction (LVEF) less than or equal to (=<) 40 percent (%).

Entity relations:
- Has_value("less than or equal to 40 percent", "=< 40 %")
- Subsumes("Left ventricular ejection fraction", "LVEF")
- Has_value("Left ventricular ejection fraction", "less than or equal to 40 percent")